Clinical trial exclusion criterion:
10. Within 30 days prior to the index study procedure, the subject has undergone a previous coronary interventional procedure of any kind. Note: This exclusion criterion does not apply to post-STEMI patients.

Annotated entities:
- Temporal: "Within 30 days prior to the index study procedure"
- Reference_point: "the index study procedure"
- Procedure: "coronary interventional procedure"
- Temporal: "previous"
- Condition: "STEMI"
- Negation: "not"